Pregnant or nursing (lactating) women

The above is a clinical trial exclusion criterion. Annotated with entity spans:
[Condition: Pregnant] or [Observation: nursing] ([Observation: lactating]) [Person: women]